Significant renal or hepatic disease as evidenced by a serum creatinine greater than 1.5× upper limit of normal (ULN), serum transaminases greater than 3× ULN, or total bilirubin greater than 1.5× ULN in absence of Gilbert's syndrome

The above is a clinical trial exclusion criterion. Annotated with entity spans:
[Qualifier: Significant] [Condition: renal] or [Condition: hepatic disease] as evidenced by a [Measurement: serum creatinine] [Value: greater than 1.5× upper limit of normal (ULN)], [Measurement: serum transaminases] [Value: greater than 3× ULN], or [Measurement: total bilirubin] [Value: greater than 1.5× ULN] in [Negation: absence of] [Condition: Gilbert's syndrome]